La conversión del piruvato en etanol y CO2 por las levaduras:
1. Produce una cantidad extra de ATP.
2. Reduce el NAD+.
3. Reoxida el NADPH que se forma en la glicólisis.
4. Permite que la glicólisis pueda continuar aún en ausencia de oxígeno.
5. Permite que el CO2 se emplee en la síntesis de ácidos grasos.

Respuesta correcta: 4. Permite que la glicólisis pueda continuar aún en ausencia de oxígeno.